受外力造成股骨的大轉子（greater trochanter）破損，下列何者最不受影響？
A. 臀大肌
B. 臀中肌
C. 臀小肌
D. 梨狀肌

正確答案：A. 臀大肌